有關腦室和中央管內襯細胞之敘述，下列何者錯誤？
A. 它是室管膜細胞
B. 其游離面有纖毛和微絨毛
C. 其底部位於基底膜上
D. 是一種神經膠細胞

正確答案：C. 其底部位於基底膜上